Clinical trial exclusion criterion:
16. Childbearing-aged female subject who is unmarried or dose not bear child;

Entity relations:
- Has_negation("bear child", "not")